Clinical trial exclusion criterion:
Evidence of a clinically significant neurological disease that might affect cognition (e.g., delirium, dementia, epilepsy, head trauma, and multiple sclerosis)

Entity relations:
- Has_qualifier("neurological disease", "might affect cognition")
- Has_qualifier("neurological disease", "clinically significant")
- AND("neurological disease", "delirium")
- Has_mood("neurological disease", "Evidence")
- OR("delirium", "multiple sclerosis", "epilepsy", "dementia", "head trauma")